Clinical trial exclusion criterion:
Personal history of breast cancer

Annotated entities:
- Condition: "breast cancer"
- Temporal: "Personal history"